Which are the subtypes of Pfeiffer syndrome?

Pfeiffer syndrome is divided into three clinical subtypes.